¿Cuáles son los líderes de la Escuela Estructural/Estratégica de la Terapia Sistémica?
1. O’Hanlon y Weiner-Davis.
2. Haley y Minuchin.
3. Weakland y Fisch.
4. Keeney y Ross.
5. Stierlin y Weber.

Respuesta correcta: 2. Haley y Minuchin.